Clinical trial exclusion criterion:
Treatment with warfarin

Annotated entities:
- Drug: "warfarin"
- Procedure: "Treatment"